Which is the function of the PRDM9 protein in mammals?

Developmental progress of germ cells through meiotic phases is closely tied to ongoing meiotic recombination. In mammals, recombination preferentially occurs in genomic regions known as hotspots; the protein that activates these hotspots is  PRDM9,. In mammals, genetic recombination during meiosis is limited to a set of 1- to 2-kb regions termed hotspots.